¿Qué nombre reciben los Códigos que definen el bien interno de la profesión enfermera, conforme al que se enuncian las obligaciones y responsabilidades y se promueve la excelencia profesional?
1. Deontológicos.
2. Éticos.
3. Bioéticos.
4. Prácticos.
5. Del Cuidado.

Respuesta correcta: 2. Éticos.